Complicating health factors precluding the use of opioids or acetaminophen

The above is a clinical trial exclusion criterion. Annotated with entity spans:
[Condition: Complicating health factors] [Condition: precluding] the use of [Drug: opioids] or [Drug: acetaminophen]